Clinical trial exclusion criterion:
Active malignancy

Annotated entities:
- Condition: "malignancy"
- Qualifier: "Active"